Late diabetic complications as retinopathy, renal insufficiency, neuropathy or previous pancreatitis.

The above is a clinical trial exclusion criterion. Annotated with entity spans:
[Condition: Late diabetic complications] as [Condition: retinopathy], [Condition: renal insufficiency], [Condition: neuropathy] or [Temporal: previous] [Condition: pancreatitis].